懷孕時陰道會變成紫色充血狀稱為：
A. Chadwick sign
B. Hegar sign
C. Ladin sign
D. Piskacek sign

正確答案：A. Chadwick sign